Clinical trial exclusion criterion:
Human immunodeficiency virus (HIV) or human immunodeficiency virus (AIDS)

Entity relations:
- OR("Human immunodeficiency virus (HIV)", "human immunodeficiency virus (AIDS)")